nondiabetic patients

The above is a clinical trial inclusion criterion. Annotated with entity spans:
[Negation: non][Condition: diabetic] patients